65 歲老先生有 40 年的抽菸習慣，每星期約兩包，約三個月前開始有慢性咳嗽，一星期前開始有咳血絲，經胸部 X 光檢查在左側肺門有顆約 10 公分大腫瘤。請問該腫瘤與下列何種物質關係最密切？
A. Nicotin
B. Carbon monoxide
C. Nitrosamines
D. Nitrous oxide compounds

正確答案：C. Nitrosamines